Clinical trial inclusion criteria:
women
proven pelvic floor dysfunction
informed consent

Annotated entities:
- Person: "women"
- Condition: "pelvic floor dysfunction"
- Informed_consent: "nformed consent"